Clinical trial inclusion criteria:
Need of lower third molar surgeries

Annotated entities:
- Procedure: "surgeries"
- Qualifier: "lower third molar"